根據治療指數（therapeutic index）的評估方式，下列那一種鎮靜-催眠（sedative-hypnotic）類藥物的使用安全性最高？
A. Morphine
B. Chloropromazine
C. Phenobarbital
D. Diazepam

正確答案：D. Diazepam